Informed consent as documented by signature

The above is a clinical trial inclusion criterion. Annotated with entity spans:
I[Informed_consent: nformed consent as documented by signature]